Clinical trial inclusion criterion:
disease duration of at least 5 years.

Entity relations:
- Has_value("disease duration", "at least 5 years")